關於抗癲癇藥物valproic acid作用的敘述，下列何者正確？
A. 僅可用於失神發作，對其他類型的發作沒有效果
B. 主要作用機轉為抑制鈉離子通道，與GABA系統無關
C. 會增加許多抗癲癇藥物如phenytoin和carbamazepine的代謝
D. 可用於治療躁鬱症以及預防偏頭痛

正確答案：D. 可用於治療躁鬱症以及預防偏頭痛